Moderate or severe valvular disease.

The above is a clinical trial exclusion criterion. Annotated with entity spans:
[Qualifier: Moderate] or [Qualifier: severe] [Condition: valvular disease].